What is vesiduction?

'Vesiduction' as a fourth mode of intercellular DNA transfer.